下列那一種研究設計不屬於觀察型流行病學？
A. 病例對照研究法
B. 世代追蹤研究法
C. 生態相關研究法
D. 臨床試

正確答案：D. 臨床試